Clinical trial exclusion criterion:
Patients with a known diagnosis of defective hemostasis and past history of clinical bleeding requiring transfusion and treatment;

Annotated entities:
- Condition: "hemostasis"
- Qualifier: "defective"
- Condition: "bleeding"
- Procedure: "transfusion"
- Procedure: "treatment"